Individuals with scalp shrapnel, cochlear implants, or aneurysm clips.

The above is a clinical trial exclusion criterion. Annotated with entity spans:
Individuals with [Device: scalp shrapnel], [Device: cochlear implants], or [Device: aneurysm clips].